Clinical trial inclusion criterion:
Informed consent available

Annotated entities:
- Non-query-able: "Informed consent available"